Clinical trial exclusion criterion:
Enrolment of the investigator, his/her family members, employees and other dependent persons

Annotated entities:
- Non-query-able: "Enrolment of the investigator, his/her family members, employees and other dependent persons"